Accompanied with other severe disease (involve C.diff infection)

The above is a clinical trial exclusion criterion. Annotated with entity spans:
Accompanied with other [Condition: severe disease] (involve [Condition: C.diff infection])